Clinical trial inclusion criteria:
Children 7-17 with moderate to severe pain requiring around the clock treatment with an opioid analgesic.
Be an experienced opioid user, defined as any subject treated with opioid therapy, equivalent or equal to >20 mg per day of morphine, for a period of 3 consecutive days immediately prior to first day of dosing.

Annotated entities:
- Person: "Children"
- Condition: "pain"
- Qualifier: "moderate"
- Qualifier: "severe"
- Drug: "opioid analgesic"
- Procedure: "around the clock treatment"
- Drug: "opioid therapy"
- Drug: "morphine"
- Multiplier: ">20 mg per day"
- Qualifier: "equivalent"
- Drug: "morphine"
- Temporal: "3 consecutive days immediately prior to first day of dosing"
- Reference_point: "first day of dosing"